Clinical trial inclusion criteria:
Adults = 18 years of age
Admitted to any ICU and receiving invasive mechanical ventilation
Anticipated ventilation of =72 hours at the time of screening, as per the ICU physician.

Annotated entities:
- Person: "age"
- Value: "= 18 years"
- Person: "Adults"
- Visit: "ICU"
- Procedure: "mechanical ventilation"
- Qualifier: "invasive"
- Temporal: "=72 hours"
- Procedure: "ventilation"
- Mood: "Anticipated"